History of local radiation therapy in the last five years.

The above is a clinical trial exclusion criterion. Annotated with entity spans:
History of [Procedure: local radiation therapy] in the [Temporal: last five years].